Su equipo recibe un aviso para la atención en la vía pública de un adolescente con alteración del nivel de consciencia. Su grupo de amigos comenta que ha “bebido mucho”, negando el consumo de otras sustancias tóxicas. A la exploración, el paciente es incapaz de mantener la bipedestación sin ayuda, responde con “gruñidos” y retirada lenta a la estimulación dolorosa abriendo los ojos al llamarle contundentemente por su nombre. Presenta pupilas mióticas y simétricas, con reactividad a la luz enlentecida. ¿Cuáles serían los cuidados iniciales a ese paciente?:
1. Estabilización del paciente (ABC) y realización de test rápido de tóxicos y glucemia en sangre capilar para poder establecer el plan terapéutico. Traslado al hospital.
2. Estabilización del paciente (ABC), posición de seguridad, protección térmica, monitorización y canalización de vía venosa periférica para administración de fluidoterapia con suero glucosado al 5%, previa administración de 100 mg de tiamina, corrección de hipoglucemia y acidosis, según datos analíticos. Determinación rápida de tóxicos y administración de antídoto, cuando proceda. Traslado al hospital.
3. Estabilización del paciente (ABC), administración de carbón activado sin provocar el vómito hasta que esté totalmente consciente, y naloxona intra muscular (0,2-0,4 mg). Traslado al hospital.
4. Estabilización del paciente (ABC), posición de seguridad y canalización de vía venosa central para administración de carga con glucosa hipertónica al 50%, bolo de bicarbonato 1M (5 mEq/kg) y posterior instauración de fluidoterapia rápida con solución Ringer®. Traslado al hospital.

Respuesta correcta: 2. Estabilización del paciente (ABC), posición de seguridad, protección térmica, monitorización y canalización de vía venosa periférica para administración de fluidoterapia con suero glucosado al 5%, previa administración de 100 mg de tiamina, corrección de hipoglucemia y acidosis, según datos analíticos. Determinación rápida de tóxicos y administración de antídoto, cuando proceda. Traslado al hospital.